Por oxidación de un alcohol primario se forma inicialmente:
1. Una cetona.
2. Un aldehído.
3. Un cloruro de ácido.
4. Un ester.

Respuesta correcta: 2. Un aldehído.